Clinical trial inclusion criterion:
Both males and females.

Entity relations:
- OR("males", "females")